Son responsables de la forma y el movimiento de la superficie celular:
1. Tubulinas.
2. Filamentos intermedios.
3. Filamentos de actina.
4. Filamentos de miosina.

Respuesta correcta: 3. Filamentos de actina.